Clinical trial exclusion criteria:
History of prostate, bladder, or rectal cancer
History of transurethral resection of the prostate (TURP), open prostate surgery, or radiofrequency or microwave therapies
History of open bladder, rectosigmoid colon, or other pelvic surgery
Patient is unwilling to discontinue alpha blockers 1 month after study treatment
Patient is unwilling to discontinue 5-alph reductase inhibitors 1 month after study treatment
Neurogenic bladder or other neurologic disorder impacting bladder function such as Parkinson's disease, multiple sclerosis, cerebral vascular accident or diabetes
Any other confounding bladder or urethral pathology, including urethral stricture, bladder neck contracture, or bladder atonia
Active prostatitis or urinary tract infection
Cystolithiasis within the past 3 months
Serum creatinine > 1.7mg/dL
Inability to discontinue oral anticoagulant 2-5 days prior to study treatment
Coagulation disturbances not normalized by medical treatment
Iodinated contrast allergy that, in the opinion of the Investigator, cannot be adequately premedicated
Gelatin allergy
Known severe peripheral vascular disease or major iliac arterial occlusive disease
Interest in future fertility
Clinically significant cardiac arrhythmia or other cardiac disease (including congestive heart failure), uncontrolled diabetes mellitus, clinically significant respiratory disease, or known immunosuppression
Other condition that the Investigator believes puts the patient at risk for a complication during the procedure

Annotated entities:
- Condition: "rectal cancer"
- Condition: "bladder cancer"
- Condition: "prostate cancer"
- Procedure: "transurethral resection of the prostate (TURP)"
- Procedure: "open prostate surgery"
- Procedure: "radiofrequency"
- Procedure: "microwave therapies"
- Procedure: "open bladder surgery"
- Procedure: "pelvic surgery"
- Procedure: "rectosigmoid colon surgery"
- Non-query-able: "Patient is unwilling to discontinue alpha blockers 1 month after study treatment"
- Drug: "alpha blockers"
- Temporal: "1 month after study treatment"
- Reference_point: "study treatment"
- Drug: "5-alph reductase inhibitors"
- Temporal: "1 month after study treatment"
- Non-query-able: "Patient is unwilling to discontinue 5-alph reductase inhibitors 1 month after study treatment"
- Condition: "Neurogenic bladder"
- Condition: "neurologic disorder impacting bladder function"
- Condition: "Parkinson's disease"
- Condition: "multiple sclerosis"
- Condition: "cerebral vascular accident"
- Condition: "diabetes"
- Condition: "urethral pathology"
- Undefined_semantics: "urethral pathology"
- Condition: "urethral stricture"
- Condition: "bladder neck contracture"
- Condition: "bladder atonia"
- Condition: "bladder pathology"
- Undefined_semantics: "bladder pathology"
- Condition: "prostatitis"
- Condition: "urinary tract infection"
- Temporal: "Active"
- Condition: "Cystolithiasis"
- Temporal: "within the past 3 months"
- Measurement: "Serum creatinine"
- Value: "> 1.7mg/dL"
- Drug: "oral anticoagulant"
- Temporal: "2-5 days prior to study treatment"
- Reference_point: "study treatment"
- Non-query-able: "Inability to discontinue oral anticoagulant 2-5 days prior to study treatment"
- Condition: "Coagulation disturbances"
- Undefined_semantics: "Coagulation disturbances"
- Procedure: "medical treatment"
- Qualifier: "normalized"
- Negation: "not"
- Condition: "allergy"
- Drug: "Iodinated contrast"
- Non-query-able: "Iodinated contrast allergy that, in the opinion of the Investigator, cannot be adequately premedicated"
- Condition: "allergy"
- Drug: "Gelatin"
- Condition: "peripheral vascular disease"
- Qualifier: "severe"
- Condition: "iliac arterial occlusive disease"
- Qualifier: "major"
- Subjective_judgement: "major"
- Subjective_judgement: "severe"
- Post-eligibility: "Interest in future fertility"
- Non-query-able: "Interest in future fertility"
- Condition: "cardiac arrhythmia"
- Condition: "cardiac disease"
- Condition: "congestive heart failure"
- Condition: "diabetes mellitus"
- Qualifier: "uncontrolled"
- Condition: "respiratory disease"
- Qualifier: "clinically significant"
- Non-query-able: "clinically significant"
- Subjective_judgement: "clinically significant"
- Condition: "immunosuppression"
- Non-query-able: "Other condition that the Investigator believes puts the patient at risk for a complication during the procedure"
- Post-eligibility: "Other condition that the Investigator believes puts the patient at risk for a complication during the procedure"